Cuando se comparan los perfiles de flujo en electroforesis capilar (CE) y en cromatografía líquida de alta resolución (HPLC) se observa que:
1. Al ser en HPLC la velocidad lineal mínima en el eje del tubo, se obtiene un perfil de flujo hiperbólico impulsado por un gradiente de presión mecánica.
2. Al circular el fluido en CE por un tubo cilíndrico recto, sin rellenos ni irregularidades, se produce un perfil de flujo laminar.
3. Al utilizar en CE un potencial eléctrico como fuerza motora de la separación, el perfil es plano frente al parabólico típico de HPLC.
4. Al necesitar en CE menos cantidad de muestra, el perfil es muy ancho y largo obteniéndose resoluciones elevadas.

Respuesta correcta: 3. Al utilizar en CE un potencial eléctrico como fuerza motora de la separación, el perfil es plano frente al parabólico típico de HPLC.